Clinical trial inclusion criterion:
AUDIT score of > or equal to 5, < or equal to 26

Entity relations:
- Has_value("AUDIT", "score of > or equal to 5, < or equal to 26")